Clinical trial exclusion criterion:
History of rheumatoid arthritis

Annotated entities:
- Condition: "rheumatoid arthritis"